Clinical trial inclusion criterion:
Adult men and women> 18 years old

Entity relations:
- Has_value("old", "> 18 years old")
- OR("men", "women")